膝關節韌帶受傷造成整隻小腿可以往前拖出（anterior draw），下列何者最可能斷裂？
A. 前十字韌帶（anterior cruciate ligament）
B. 後十字韌帶（posterior cruciate ligament）
C. 脛側副韌帶（tibial collateral ligament）
D. 腓側副韌帶（fibular collateral ligament）

正確答案：A. 前十字韌帶（anterior cruciate ligament）